Pregnant woman with infection of human immunodeficiency virus or hepatitis C virus

The above is a clinical trial exclusion criterion. Annotated with entity spans:
[Condition: Pregnant] [Person: woman] with infection of [Condition: human immunodeficiency virus] or [Condition: hepatitis C virus]